Clinical trial exclusion criterion:
Neoadjuvant chemotherapy for current malignancy

Entity relations:
- AND("Neoadjuvant chemotherapy", "malignancy")